Clinical trial exclusion criteria:
Any other variety of LAL
Patients with a history of coronary artery disease, valvular or hypertensive heart disease
Patients with chronic liver disease
Patients with chronic respiratory failure
Renal failure not due to LAL
Patients with positive HIV status
No serious neurological abnormalities due to LAL
Impact on overall severe (grade 3 or 4 of the WHO scale) not attributable to the LAL
Pregnant or breastfeeding
initial blast crisis CML

Annotated entities:
- Qualifier: "other variety"
- Condition: "LAL"
- Temporal: "history"
- Condition: "coronary artery disease"
- Condition: "hypertensive heart disease"
- Condition: "heart disease valvular"
- Condition: "chronic liver disease"
- Condition: "chronic respiratory failure"
- Condition: "Renal failure"
- Condition: "LAL"
- Negation: "not"
- Mood: "due to"
- Value: "positive"
- Measurement: "HIV status"
- Negation: "No"
- Qualifier: "serious"
- Condition: "neurological abnormalities"
- Mood: "due to"
- Condition: "LAL"
- Non-representable: "Impact on overall severe (grade 3 or 4 of the WHO scale) not attributable to the LAL"
- Observation: "Pregnant"
- Observation: "breastfeeding"
- Qualifier: "blast crisis"
- Condition: "CML"